Clinical trial inclusion criterion:
Negative H. pylori test .

Entity relations:
- Has_value("H. pylori test", "Negative")